林小姐罹患乳癌須接受一側乳房切除，她想同時接受乳房重建手術，則下列那一個皮瓣最不適合用來作為乳房重建之用？
A. 闊背肌肌皮瓣（latissimus dorsi muscle flap）
B. 橫腹直肌皮瓣（transverse rectus abdominis myocutaneous flap）
C. 上臀動脈穿通枝皮瓣（superior gluteal artery perforator flap）
D. 腹網膜瓣（omental flap）

正確答案：D. 腹網膜瓣（omental flap）